Clinical trial exclusion criterion:
No serious neurological abnormalities due to LAL

Entity relations:
- Has_mood("LAL", "due to")
- AND("neurological abnormalities", "LAL")
- Has_qualifier("neurological abnormalities", "serious")
- Has_negation("neurological abnormalities", "No")